Clinical trial exclusion criterion:
chronic liver disease (including known active hepatitis) and/or screening alanine transaminase (ALT) or aspartate transaminase (AST) > 3 x upper limit of normal (ULN) (confirmed on a second day)

Entity relations:
- Subsumes("chronic liver disease", "active hepatitis")
- Subsumes("alanine transaminase", "ALT")
- Subsumes("aspartate transaminase", "AST")
- Has_value("alanine transaminase", "> 3 x upper limit of normal")
- OR("alanine transaminase", "aspartate transaminase")